Clinical trial inclusion criteria:
Males aged 18 years and above
Patients with a diagnosis of prostatic carcinoma requiring prostate surgery

Annotated entities:
- Person: "Males"
- Person: "aged"
- Value: "18 years and above"
- Condition: "prostatic carcinoma"
- Procedure: "prostate surgery"